Clinical trial exclusion criterion:
cyclosporine, or

Annotated entities:
- Drug: "cyclosporine"